下列那一種 RNA 之 5'端及 3'端之核糖（ribose）， 可能同時具有 free 3'-OH？
A. 真核細胞 mRNA
B. 原核細胞 mRNA
C. 真核細胞 rRNA
D. 原核細胞 rRNA

正確答案：A. 真核細胞 mRNA